Moderate or severe liver affection associated with coagulopathy

The above is a clinical trial exclusion criterion. Annotated with entity spans:
[Qualifier: Moderate] or [Qualifier: severe] [Condition: liver affection] [Qualifier: associated with coagulopathy]